Patients anticipated to receive adjunctive C. difficile therapy (rifaxamin, nitazoxanide, tigecycline) after enrollment.

The above is a clinical trial exclusion criterion. Annotated with entity spans:
Patients [Mood: anticipated] to receive adjunctive [Procedure: C. difficile therapy] ([Drug: rifaxamin], [Drug: nitazoxanide], [Drug: tigecycline]) after enrollment.